Clinical trial exclusion criterion:
multiple gestations

Annotated entities:
- Condition: "multiple gestations"